Clinical trial exclusion criterion:
Patients with severe complications or severe infection;

Annotated entities:
- Condition: "complications"
- Qualifier: "severe"
- Qualifier: "severe"
- Condition: "infection"
- Drug: "Patients"